Have features of severe pneumonia on admission (temperature >37.5 celsius or a history of fever at home or observed at the referring clinic, age-adjusted tachypnoea [respiratory rate>50 if <12-months; respiratory rate>40 if >12-months] with chest wall recession and/or oxygen saturation <92% in air), and consolidation on chest X-ray as diagnosed by treating clinician

The above is a clinical trial inclusion criterion. Annotated with entity spans:
Have features of [Qualifier: severe] [Condition: pneumonia] on admission ([Measurement: temperature] [Value: >37.5 celsius] or a history of fever at home or observed at the referring clinic, [Person: age]-adjusted [Condition: tachypnoea] [[Measurement: respiratory rate][Value: >50] if [Value: <12-months]; [Measurement: respiratory rate][Value: >40] if [Value: >12-months]] with [Condition: chest wall recession] and/or [Measurement: oxygen saturation] [Value: <92% in air]), and [Condition: consolidation] on [Procedure: chest X-ray] as diagnosed by treating clinician